Patients with planned concomitant surgical or transcatheter ablation for Atrial Fibrillation.

The above is a clinical trial exclusion criterion. Annotated with entity spans:
Patients with [Mood: planned] [Temporal: concomitant] [Procedure: surgical] or [Procedure: transcatheter ablation] for [Condition: Atrial Fibrillation].